diagnosis of stroke (>6months);

The above is a clinical trial inclusion criterion. Annotated with entity spans:
diagnosis of [Condition: stroke] ([Temporal: >6months]);